Clinical trial inclusion criterion:
Has documented objective radiographic progression during or after treatment with sorafenib or oxaliplatin-based chemotherapy, or else intolerance to sorafenib or oxaliplatin-based chemotherapy

Entity relations:
- Has_context("radiographic", "objective progression")
- Has_qualifier("chemotherapy", "sorafenib or oxaliplatin-based")
- Has_qualifier("chemotherapy", "sorafenib or oxaliplatin-based")
- AND("intolerance", "chemotherapy")
- Has_index("during or after", "treatment with sorafenib or oxaliplatin-based chemotherapy")
- Has_temporal("radiographic", "during or after")
- OR("radiographic", "intolerance")